Anticoagulation therapy

The above is a clinical trial exclusion criterion. Annotated with entity spans:
[Procedure: Anticoagulation therapy]